Clinical trial inclusion criterion:
Age: > or = 16 years

Entity relations:
- Has_value("Age", "> or = 16 years")